Clinical trial exclusion criterion:
17. Significant peripheral edema as per investigator's discretion

Entity relations:
- Has_qualifier("peripheral edema", "Significant")